在測量血壓時，由近心端往周邊的方向逐次測量，下列敘述何者正確？
A. 收縮壓上升，舒張壓降低
B. 收縮壓上升，舒張壓上升
C. 收縮壓不變，舒張壓降低
D. 收縮壓上升，舒張壓不變

正確答案：A. 收縮壓上升，舒張壓降低